Abnormal Electro-cardiogram (ECG)

The above is a clinical trial exclusion criterion. Annotated with entity spans:
[Value: Abnormal] [Measurement: Electro-cardiogram] ([Measurement: ECG])